Clinical trial exclusion criterion:
Contra-indications for alfa-interferon therapy like suspected hypersensitivity to interferon or Peginterferon or any known pre-existing medical condition that could interfere with the patient's participation in and completion of the study.

Annotated entities:
- Condition: "Contra-indications"
- Drug: "alfa-interferon therapy"
- Condition: "hypersensitivity"
- Drug: "interferon"
- Drug: "Peginterferon"
- Non-query-able: "any known pre-existing medical condition that could interfere with the patient's participation in and completion of the study"